先天性免疫力（innate immunity）和適應性免疫力（adaptive immunity）最大的不同在於：
A. 擔任的細胞和作用對象不同
B. 反應的強度和快慢不同
C. 抗原的特異性及免疫記憶性不同
D. 發生的部位和作用先後不同

正確答案：C. 抗原的特異性及免疫記憶性不同